Clinical trial inclusion criterion:
No chemotherapy treatment (except for Deticene used before the first T cell clones infusion) or radiotherapy or immunotherapy in the last 4 weeks before infusion.

Annotated entities:
- Procedure: "chemotherapy"
- Negation: "No"
- Drug: "Deticene"
- Negation: "except for"
- Temporal: "before the first T cell clones infusion"
- Reference_point: "the first T cell clones infusion"
- Procedure: "radiotherapy"
- Procedure: "immunotherapy"
- Temporal: "in the last 4 weeks before infusion"
- Reference_point: "infusion"